Clinical trial inclusion criterion:
Patient not able to receive 12 months of dual anti-platelet therapy

Entity relations:
- Has_temporal("dual anti-platelet therapy", "12 months")